other conditions that may affect the evaluation of the trail

The above is a clinical trial exclusion criterion. Annotated with entity spans:
[Non-query-able: other conditions that may affect the evaluation of the trail]